Birth weight > 2500g

The above is a clinical trial inclusion criterion. Annotated with entity spans:
[Measurement: Birth weight] [Value: > 2500g]